Clinical trial inclusion criterion:
Patients with pulmonary arterial hypertension (PAH)

Annotated entities:
- Condition: "pulmonary arterial hypertension (PAH)"